Si tras establecer el intervalo de confianza respecto a una diferencia entre dos medias independientes, encontramos que el valor cero no se encuentra en el intervalo:
1. No podemos tomar ninguna decisión respecto de la hipótesis nula de igualdad de las medias.
2. No podemos rechazar la hipótesis nula de igualdad entre las medias poblacionales.
3. Debemos rechazar la hipótesis nula de igualdad entre las medias poblacionales.
4. Aceptamos la hipótesis nula de igualdad entre las medias poblacionales.
5. Rechazamos la hipótesis alternativa de igualdad entre las medias poblacionales.

Respuesta correcta: 3. Debemos rechazar la hipótesis nula de igualdad entre las medias poblacionales.